Clinical trial exclusion criterion:
Clinically significant intercurrent illnesses (except for respiratory or liver disease secondary to AAT deficiency), including: cardiac, hepatic, renal, endocrine, neurological, hematological, neoplastic, immunological, skeletal or other) that in the opinion of the investigator, could interfere with the safety, compliance or other aspects of this study. Patients with well-controlled, chronic diseases could possibly be included after consultation with the treating physician and the sponsor.

Entity relations:
- Has_qualifier("intercurrent illnesses", "Clinically significant")
- AND("secondary to AAT deficiency", "AAT deficiency")
- Has_negation("respiratory disease", "except for")
- Has_qualifier("respiratory disease", "secondary to AAT deficiency")
- AND("intercurrent illnesses", "respiratory disease")
- Subsumes("intercurrent illnesses", "cardiac")
- Subsumes("intercurrent illnesses", "hepatic")
- Subsumes("intercurrent illnesses", "renal")
- Subsumes("intercurrent illnesses", "endocrine")
- Subsumes("intercurrent illnesses", "neurological")
- Subsumes("intercurrent illnesses", "hematological")
- Subsumes("intercurrent illnesses", "neoplastic")
- Subsumes("intercurrent illnesses", "immunological")
- Subsumes("intercurrent illnesses", "skeletal")
- Subsumes("intercurrent illnesses", "other")
- OR("respiratory disease", "liver disease")